有一黴菌在顯微鏡下可見分隔菌絲及瓶狀產孢器（phialides）且分生孢子（conidia）排列成'paint brush'，最可能為下列何者？
A. Histoplasma capsulatum
B. Sporothrix schenckii
C. Fusarium solani
D. Penicillium marneffei

正確答案：D. Penicillium marneffei